Clinical trial exclusion criterion:
Relative contraindications to ECT therapy (recent MI or CVA, increased intracranial pressure, intracranial mass lesion, intracranial aneurysm, epilepsy, known cardiac arrhythmia, pheochromocytoma, pregnancy)

Annotated entities:
- Condition: "Relative contraindications"
- Procedure: "ECT therapy"
- Temporal: "recent"
- Condition: "MI"
- Condition: "CVA"
- Value: "increased"
- Measurement: "intracranial pressure"
- Condition: "intracranial mass lesion"
- Condition: "intracranial aneurysm"
- Condition: "epilepsy"
- Condition: "cardiac arrhythmia"
- Condition: "pheochromocytoma"
- Condition: "pregnancy"